Clinical trial exclusion criterion:
Patient has symptoms of or been diagnosed with a medical condition that may contribute to abdominal pain

Entity relations:
- multi("may contribute to abdominal pain", "abdominal pain")
- Has_qualifier("medical condition", "may contribute to abdominal pain")